Clinical trial exclusion criterion:
Untreated adrenal insufficiency.

Annotated entities:
- Condition: "adrenal insufficiency"
- Qualifier: "Untreated"